Which type of distance is used in the R-package XenofilteR?

The R-package XenofilteR separates mouse from human sequence reads based on the edit-distance between a sequence read and reference genome.